Clinical trial exclusion criterion:
Subject with any underlying cardiovascular condition, including unstable angina pectoris, which preclude sexual activity

Entity relations:
- Subsumes("cardiovascular condition", "unstable angina pectoris")
- Has_negation("sexual activity", "preclude")
- Has_context("cardiovascular condition", "sexual activity")